¿Para qué tipo de intervenciones en los problemas de conducta infantiles y juveniles ha servido como modelo conceptual la teoría de la coerción de Patterson?
1. Para el entrenamiento de padres de niños con trastornos de conducta.
2. Para las intervenciones rehabilitadoras de base cognitivo-conductual.
3. Para las intervenciones llevadas a cabo en comunidades terapéuticas.
4. Para los programas de derivación que intentan evitar los efectos estigmatizadores del etiquetado.
5. Para las economías de fichas llevadas a cabo en prisiones y reformatorios.

Respuesta correcta: 1. Para el entrenamiento de padres de niños con trastornos de conducta.